Clinical trial exclusion criterion:
Have participated in this study previously, or any other study using exenatide or GLP-1 analogs.

Annotated entities:
- Drug: "GLP-1 analogs"
- Observation: "this study"
- Observation: "any other study"
- Drug: "exenatide"